En eucariotas, la ADN polimerasa β:
1. Es una polimerasa de la familia B.
2. Lleva a cabo la síntesis y reparación del ADN mitocondrial.
3. Replica ADN con lesiones.
4. Está implicada en la reparación del ADN nuclear.
5. Comienza la síntesis del ADN nuclear.

Respuesta correcta: 4. Está implicada en la reparación del ADN nuclear.